All patients will be undergoing a primary unilateral total knee arthroplasty for a diagnosis of osteoarthritis

The above is a clinical trial inclusion criterion. Annotated with entity spans:
All patients will be undergoing a [Qualifier: primary] [Procedure: unilateral total knee arthroplasty] for a diagnosis of [Condition: osteoarthritis]